有關運動控制（motor control），下列敘述何者正確？
A. 只有來自大腦運動皮層的神經元可以控制骨骼肌收縮
B. α運動神經元細胞本體位於大腦運動皮層
C. 基底核（basal nuclei）的神經元與骨骼肌有興奮和抑制的突觸連結
D. 基底核（basal nuclei）與小腦負責計畫和設計隨意動作（voluntary movement）的進行程序

正確答案：D. 基底核（basal nuclei）與小腦負責計畫和設計隨意動作（voluntary movement）的進行程序